Clinical trial exclusion criterion:
Unstable angina pectoris as judged by the investigator, clinically significant uncorrected valvular disease or left ventricular outflow obstruction, obstructive cardiomyopathy, poorly controlled fast atrial fibrillation or flutter, poorly controlled symptomatic brady- or tachyarrhythmias.

Annotated entities:
- Condition: "Unstable angina pectoris"
- Qualifier: "clinically significant"
- Condition: "valvular disease"
- Condition: "left ventricular outflow obstruction"
- Condition: "obstructive cardiomyopathy"
- Qualifier: "poorly controlled"
- Condition: "fast atrial fibrillation"
- Condition: "fast atrial flutter"
- Qualifier: "poorly controlled"
- Qualifier: "symptomatic"
- Condition: "tachyarrhythmias"
- Condition: "brady-"